下列何者不傳遞鑑別性觸覺（discriminative touch）？
A. 背側三叉神經丘腦徑（dorsal trigeminothalamic tract）
B. 腹側三叉神經丘腦徑（ventral trigeminothalamic tract）
C. 內弓狀纖維（internal arcuate fibers）
D. 脊髓丘腦徑（spinothalamic tract）

正確答案：D. 脊髓丘腦徑（spinothalamic tract）